Clinical trial inclusion criterion:
5. Age ≥18 years

Annotated entities:
- Parsing_Error: "5."
- Person: "Age"
- Value: "≥18 years"